子宮頸癌最常見的組織類型為何？
A. squamous cell carcinoma
B. adenocarcinoma
C. adenosquamous cell carcinoma
D. small cell carcinoma

正確答案：A. squamous cell carcinoma